Clinical trial inclusion criterion:
Are able to comprehend and sign a written informed consent

Annotated entities:
- Observation: "able to comprehend a written informed consent"
- Observation: "able to sign a written informed consent"